Currently pregnant or using a reliable contraception (e.g. injectables, intrauterine devices, implant, oral contraceptive pills)

The above is a clinical trial exclusion criterion. Annotated with entity spans:
[Pregnancy_considerations: Currently pregnant or using a reliable contraception (e.g. injectables, intrauterine devices, implant, oral contraceptive pills)]